Clinical trial exclusion criterion:
History of allergic reaction to compounds of similar chemical or biologic composition to hCG

Annotated entities:
- Temporal: "History"
- Condition: "allergic reaction"
- Drug: "compounds of similar chemical or biologic composition to hCG"
- Drug: "hCG"